Female of childbearing potential planing/being pregnant or unwilling to use contraception.

The above is a clinical trial exclusion criterion. Annotated with entity spans:
[Pregnancy_considerations: Female of childbearing potential planing/being pregnant or unwilling to use contraception.]